Clinical trial inclusion criterion:
2. CEAP Classification Stage 6

Entity relations:
- Has_value("CEAP Classification", "Stage 6")